No prior ART, including prior administration of pre- and post-exposure prophylaxis in the last 30 days

The above is a clinical trial inclusion criterion. Annotated with entity spans:
[Negation: No] [Temporal: prior] [Procedure: ART], including [Temporal: prior] [Procedure: administration] of [Drug: pre-] and [Drug: post-exposure prophylaxis] [Temporal: in the last 30 days]